一位疑似有癲癇發作之病人接受腦波檢查，其腦波是正常的，這表示：
A. 不能排除有癲癇發作之可能
B. 一定沒有癲癇發作
C. 一定有癲癇發作
D. 不需要門診追蹤

正確答案：A. 不能排除有癲癇發作之可能